History of multiple myeloma

The above is a clinical trial exclusion criterion. Annotated with entity spans:
[Temporal: History] of [Condition: multiple myeloma]